超音波最適合用來診斷下列何種肌肉骨骼疾病？
A. metastatic bone lesion
B. chronic bone infection
C. avascular bone necrosis
D. tenosynovitis

正確答案：D. tenosynovitis